Clinical trial exclusion criterion:
chronic use of pain medication

Annotated entities:
- Multiplier: "chronic use"
- Drug: "pain medication"